Clinical trial exclusion criterion:
Contraindications to magnetic resonance imaging (MRI).

Entity relations:
- AND("Contraindications", "magnetic resonance imaging (MRI)")